Clinical trial exclusion criterion:
Patients who are on steroid therapy due to positive result of acute rejection test before the baseline.

Annotated entities:
- Drug: "steroid"
- Measurement: "acute rejection test"
- Value: "positive"